Clinical trial inclusion criterion:
Alanine aminotransferase, alkaline phosphatase and bilirubin <=1.5x upper limit of normal (ULN) (isolated bilirubin >1.5xULN is acceptable if bilirubin is fractionated and direct bilirubin <35%).

Entity relations:
- Has_value("Alanine aminotransferase", "<=1.5x upper limit of normal (ULN)")
- Has_value("bilirubin", ">1.5xULN")
- Has_value("alkaline phosphatase", "<=1.5x upper limit of normal (ULN)")
- Has_value("bilirubin", "<=1.5x upper limit of normal (ULN)")